Which kinase does PD98059 inhibit?

PD98059 is a specific, reversible MEK inhibitor.